Clinical trial exclusion criteria:
Type 1 diabetes mellitus,presence of autoimmune diabetes indicated by antibodies to insulin, islet cells, and GAD;
Gestational diabetes;
patients with heart, liver, or renal function impairment;presence of severe infections or cerebrovascular disease;

Annotated entities:
- Condition: "Type 1 diabetes mellitus"
- Condition: "autoimmune diabetes"
- Condition: "antibodies"
- Qualifier: "insulin"
- Qualifier: "islet cells"
- Qualifier: "GAD"
- Condition: "Gestational diabetes"
- Condition: "renal function impairment"
- Condition: "liver function impairment"
- Condition: "heart function impairment"
- Qualifier: "severe"
- Condition: "infections"
- Condition: "cerebrovascular disease"